Clinical trial exclusion criterion:
Known platelet count <80x106/mL

Entity relations:
- Has_value("platelet count", "<80x106/mL")